Clinical trial exclusion criterion:
Patients at risk for endovascular infection (previously documented rheumatic heart disease, congenital valve disease, surgically repaired congenital heart disease, unrepaired cyanotic congenital heart disease, any intracardiac repair with prosthetic material [mechanical or bio-prosthetic cardiac valves], previous or current endocarditis, permanent endovascular devices (e.g., endovascular grafts [e.g., aortic aneurysm repair, stents involving large arteries such as aorta, femorals and carotids], inferior vena cava filters, dialysis vascular grafts), tunnelled (not short-term) hemodialysis catheters, pacemakers or defibrillators. Patients with temporary central venous catheters, central venous dialysis catheters or peripherally inserted central catheters (PICCs) are not excluded and patients with coronary artery stents, coronary artery bypass grafts (CABG) or neurovascular coils are not excluded; patients with mitral valve prolapse or bicuspid aortic valve are not excluded providing they have no other exclusion criteria;

Annotated entities:
- Observation: "risk for endovascular infection"
- Condition: "rheumatic heart disease"
- Condition: "congenital valve disease"
- Condition: "congenital heart disease"
- Qualifier: "surgically repaired"
- Condition: "cyanotic congenital heart disease"
- Qualifier: "unrepaired"
- Procedure: "intracardiac repair"
- Device: "prosthetic material"
- Device: "bio-prosthetic cardiac valves]"
- Device: "mechanical cardiac valves"
- Condition: "endocarditis"
- Device: "endovascular devices"
- Qualifier: "permanent"
- Device: "endovascular grafts"
- Procedure: "aortic aneurysm repair"
- Device: "stents"
- Qualifier: "large arteries"
- Device: "inferior vena cava filters"
- Device: "dialysis vascular grafts"
- Device: "hemodialysis catheters"
- Device: "pacemakers"
- Device: "central venous catheters"
- Device: "central venous dialysis catheters"
- Device: "peripherally inserted central catheters"
- Negation: "not"
- Negation: "not"
- Device: "coronary artery stents"
- Device: "coronary artery bypass grafts"
- Device: "neurovascular coils"
- Negation: "not"
- Condition: "mitral valve prolapse"
- Condition: "bicuspid aortic valve"
- Device: "PICCs"